若要正確診斷同時作外科前的計畫評估，下列那種檢查最需要？
A. 杜卜勒超音波檢查
B. 動脈血管攝影
C. 股動脈臂動脈壓比值（Femoro-brachial pressure ratio）
D. Plethysmography

正確答案：B. 動脈血管攝影